Clinical trial exclusion criterion:
History of a chronic pain condition

Annotated entities:
- Condition: "chronic pain"